Clinical trial exclusion criterion:
Known allergies to midodrine hydrochloride;

Entity relations:
- AND("allergies", "midodrine hydrochloride")